Clinical trial inclusion criterion:
subjects who sign the informed consent document

Annotated entities:
- Observation: "sign the informed consent"